一位 58 歲男性因聲音沙啞求診，經內視鏡檢查顯示左側聲帶麻痺，胸部 X 光發現左上肺有陰影，則下列敘述何者最可能？
A. 病人可能罹患肺癌併發腦幹轉移
B. 病人可能罹患肺癌併發喉局部轉移
C. 病人可能罹患喉癌併發肺部轉移
D. 病人可能罹患肺癌壓迫喉返神經（recurrent laryngeal nerve）

正確答案：D. 病人可能罹患肺癌壓迫喉返神經（recurrent laryngeal nerve）